Clinical trial inclusion criterion:
Atrial fibrillation or flutter on electrocardiogram

Annotated entities:
- Condition: "Atrial fibrillation"
- Condition: "Atrial flutter"
- Procedure: "electrocardiogram"